Clinical trial inclusion criterion:
Inborn preterm infants born between 28 0/7 and 34 0/7 weeks gestation and fed either mother's own milk or donor human milk

Entity relations:
- AND("infants", "preterm")
- AND("infants", "Inborn")
- Has_value("gestation", "between 28 0/7 and 34 0/7 weeks")
- OR("fed mother's own milk", "donor human milk fed")